有關口腔癌手術後接受輔助性放化療（chemoradiation）之敘述，下列何者錯誤？
A. 輔助性放化療最好在術後超過6週才開始，避免影響傷口癒合
B. 有淋巴結膜外擴散之病人是輔助性放化療的適應症
C. 切緣（section margin）有腫瘤細胞，輔助性放化療仍有助於病情的控制
D. 第四期病人手術即使切除完整，也建議給予輔助性放化療

正確答案：A. 輔助性放化療最好在術後超過6週才開始，避免影響傷口癒合